Clinical trial inclusion criterion:
Mild-to-moderate RDS;

Annotated entities:
- Value: "Mild-to-moderate"
- Measurement: "RDS"